En las investigaciones de encuesta se trabaja con una muestra representativa de la población. ¿Qué supone esto?:
1. La muestra refleja fielmente las variables que caracterizan a la población y su tamaño es adecuado.
2. Las conclusiones del estudio sólo describen a la muestra concreta y no son generalizables.
3. Obtenemos información incompleta y sesgada por las características de la muestra.
4. El criterio básico de inclusión en la muestra es la accesibilidad de los participantes.
5. El tamaño de la muestra debe ser lo más próximo posible al de la población.

Respuesta correcta: 1. La muestra refleja fielmente las variables que caracterizan a la población y su tamaño es adecuado.